Chico de 18 años con dolor mamario y nódulo retroareolar en la palpación. ¿Cuál es la causa más frecuente?
1. Carcinoma de mama.
2. Mastitis periductal.
3. Papiloma intraductal.
4. Ginecomastia puberal.

Respuesta correcta: 4. Ginecomastia puberal.